La técnica de análisis térmico diferencial (DSC) permite:
1. Establecer el tamaño y forma de las partículas de un compuesto.
2. Cuantificar los procesos que sufre una muestra durante su calentamiento indicando si el proceso es endotérmico o exotérmico.
3. Conocer la densidad de las partículas de muestra.
4. Determinar la estructura orgánica de un compuesto.

Respuesta correcta: 2. Cuantificar los procesos que sufre una muestra durante su calentamiento indicando si el proceso es endotérmico o exotérmico.